Age ≥ 18 years (Age ≥ 12 years for patients with bone sarcomas).

The above is a clinical trial inclusion criterion. Annotated with entity spans:
[Person: Age] [Value: ≥ 18 years] ([Person: Age] [Value: ≥ 12 years] for patients with [Condition: bone sarcomas]).